Clinical trial inclusion criterion:
Glycemic control: HbA1c = 10.0%

Annotated entities:
- Measurement: "HbA1c"
- Value: "= 10.0%"